Clinical trial inclusion criterion:
Calculated eGFR below 60ml/min/1.73m2 (MDRD)

Entity relations:
- Has_value("Calculated eGFR", "below 60ml/min/1.73m2")